Clinical trial inclusion criterion:
All women of childbearing potential (WOCBP) must be practicing a medically acceptable method of birth control

Entity relations:
- Subsumes("WOCBP", "women")
- Has_qualifier("birth control", "medically acceptable")
- AND("WOCBP", "birth control")
- Subsumes("WOCBP", "childbearing potential")